Active bleeding or at high risk of bleeding

The above is a clinical trial exclusion criterion. Annotated with entity spans:
[Qualifier: Active] [Condition: bleeding] or [Qualifier: at high risk] of [Condition: bleeding]